Clinical trial inclusion criterion:
7. Normal laboratory values or clinically insignificant findings at screening as determined by the Investigator;

Annotated entities:
- Parsing_Error: "7."
- Condition: "Normal laboratory values"
- Value: "Normal"
- Procedure: "laboratory"
- Measurement: "laboratory"
- Qualifier: "clinically insignificant"
- Subjective_judgement: "clinically insignificant"
- Condition: "findings"
- Temporal: "at screening"
- Reference_point: "screening"
- Subjective_judgement: "as determined by the Investigator"